除初乳之外，下列關於母乳（Breast milk）與嬰兒配方（Infant formula）的描述和比較何者最為正確？
A. 母乳所含的蛋白質濃度較低，嬰兒配方所含的蛋白質濃度較高
B. 母乳所含的脂肪濃度較低，嬰兒配方所含的脂肪濃度較高
C. 母乳中不含維生素A，嬰兒配方則含有維生素A
D. 母乳中不含維生素D，嬰兒配方則含有維生素D

正確答案：A. 母乳所含的蛋白質濃度較低，嬰兒配方所含的蛋白質濃度較高